Clinical trial exclusion criterion:
Known hemoglobin <10 g/dL

Entity relations:
- Has_value("hemoglobin", "<10 g/dL")